Clinical trial exclusion criterion:
Combined P-glycoprotein and strong cytochrome P450 (CYP) 3A4 inhibitor

Entity relations:
- Has_qualifier("cytochrome P450 3A4 inhibitor", "strong")